acetyl CoA carboxylase 所催化之反應，為脂肪酸合成途徑的關鍵步驟（committed step），下列何者為此酵素之變構活化物（allosteric activator）？
A. palmitoyl CoA
B. AMP
C. NADPH
D. citrate

正確答案：D. citrate